Organ dysfunction (renal/hepatic failure or leukemia)

The above is a clinical trial exclusion criterion. Annotated with entity spans:
[Condition: Organ dysfunction] ([Condition: renal]/[Condition: hepatic failure] or [Condition: leukemia])